Known severe heart failure, classified as NYHA 4.

The above is a clinical trial exclusion criterion. Annotated with entity spans:
Known [Qualifier: severe] [Condition: heart failure], classified as [Measurement: NYHA] [Value: 4].